Participants must have at least one symptom per month in the month prior to enrollment

The above is a clinical trial inclusion criterion. Annotated with entity spans:
Participants must have [Multiplier: at least one] [Condition: symptom] per month [Temporal: in the month prior to enrollment]